流感嗜血桿菌（Haemophilus influenzae）的生長在血液培養盤上金黃色葡萄球菌（Staphylococcus aureus）菌落的周圍有促進的現象，此是因為後者能提供其生長所需的那種成分？
A. 磷血紅素（hemin）
B. 螯鐵素（siderophores）
C. 半胱氨酸（L-cysteine）
D. 菸醯胺腺嘌呤雙核酸（nicotinamide adenine dinucleotide）

正確答案：D. 菸醯胺腺嘌呤雙核酸（nicotinamide adenine dinucleotide）